Creatinine < 2 × upper normal limits.

The above is a clinical trial inclusion criterion. Annotated with entity spans:
[Measurement: Creatinine] [Value: < 2 × upper normal limits].